Clinical trial inclusion criterion:
Experiencing GI toxicity from MPA as determined by the treating physician within 12 months post-renal transplant

Entity relations:
- AND("GI toxicity", "MPA")